Mujer diagnosticada de diabetes mellitus tipo 1 desde hace 24 años. Acude a consulta con clínica de 3 meses de evolución de hormigueos en ambos pies, con distribución en calcetín, con dolor parestésico y sensación de pies calientes de predominio nocturno, que interfiere notablemente su sueño. ¿Cuál de los siguientes fármacos utilizaría en primera línea para el tratamiento de su patología?
1. Ibuprofeno.
2. Oxicodona.
3. Duloxetina.
4. Paracetamol.

Respuesta correcta: 3. Duloxetina.